Clinical trial inclusion criterion:
General Inclusion

Annotated entities:
- Parsing_Error: "General Inclusion"